下列那種形式的胎位較適合嘗試陰道生產？
A. complete breech
B. frank breech
C. footling breech
D. transverse lie

正確答案：B. frank breech